Chronic opioid consumption

The above is a clinical trial exclusion criterion. Annotated with entity spans:
[Qualifier: Chronic] [Condition: opioid consumption]